Clinical trial exclusion criterion:
15. Concomitant administration of any prescription or over the counter medications known to be highly dependent on P450 or P-gp for clearance for which elevated plasma concentrations are known to be associated with serious toxicity

Annotated entities:
- Parsing_Error: "15."
- Temporal: "Concomitant"
- Drug: "medications known to be highly dependent on P450 for clearance"
- Drug: "medications known to be highly dependent on P-gp for clearance"
- Measurement: "plasma concentrations"
- Value: "elevated"
- Condition: "toxicity"
- Qualifier: "serious"
- Undefined_semantics: "medications known to be highly dependent on P450 or P-gp for clearance"